Symptomatic coronary artery disease deemed to be significant by study physician at the time of screening

The above is a clinical trial exclusion criterion. Annotated with entity spans:
[Qualifier: Symptomatic] [Condition: coronary artery disease] deemed to be significant by study physician [Temporal: at the time of screening]